Clinical trial exclusion criterion:
contra-indications for medical induction of labor

Annotated entities:
- Condition: "contra-indications"
- Procedure: "medical induction of labor"